Severe deformity (varus or values from mechanical axis more than 5 degrees

The above is a clinical trial exclusion criterion. Annotated with entity spans:
[Qualifier: Severe] [Condition: deformity] ([Condition: varus] or [Measurement: values from mechanical axis] [Value: more than 5 degrees]